Patients with tropical worm infection.

The above is a clinical trial exclusion criterion. Annotated with entity spans:
Patients with [Condition: tropical worm infection].